因服用抗癲癇藥物（anticonvulsants）而造成的皮膚疹（skin rash）是：
A. 與抗癲癇藥物的劑量有關（dose-related）
B. 與服用者的肝功能有關
C. 與服用者的腎功能有關
D. 是一種特異體質反應（idiosyncratic reaction）

正確答案：D. 是一種特異體質反應（idiosyncratic reaction）